Clinical trial inclusion criterion:
individuals engaging in transactional sex (i.e sex for money, drugs, or housing)

Entity relations:
- Subsumes("transactional sex", "sex for money")
- OR("sex for money", "sex for drugs", "sex for housing")